Clinical trial inclusion criteria:
Adult patient, age 18-80 years old, with ruptured aneurysm(s) who experience cerebral vasospasm post operatively within 3-21 days.

Annotated entities:
- Person: "Adult"
- Person: "age"
- Value: "18-80 years old"
- Condition: "ruptured aneurysm"
- Condition: "cerebral vasospasm"
- Temporal: "post operatively within 3-21 days"
- Reference_point: "post operatively"